alanine aminotransferase (ALT), aspartase aminotransferase (AST), or alkaline phosphatase = 10 times upper limit of normal(ULN)

The above is a clinical trial exclusion criterion. Annotated with entity spans:
[Measurement: alanine aminotransferase] ([Measurement: ALT]), [Measurement: aspartase aminotransferase] ([Measurement: AST]), or [Measurement: alkaline phosphatase] [Value: = 10 times upper limit of normal](ULN)